下列關於甲狀腺手術可能造成的nerve injury，何者錯誤？
A. 若傷及recurrent laryngeal nerve，會導致聲帶麻痺
B. 若傷及external branch of superior laryngeal nerve，會導致發高音困難
C. 手術不易傷及internal branch of superior laryngeal nerve
D. 若傷及cervical sympathetic trunk，會導致Wermer's syndrome

正確答案：D. 若傷及cervical sympathetic trunk，會導致Wermer's syndrome